Clinical trial exclusion criterion:
Constitutional illness (eg, persistent unexplained fever, diarrhea, significant weight loss, disabling weakness) within 30 days of screening

Annotated entities:
- Condition: "Constitutional illness"
- Condition: "unexplained fever"
- Multiplier: "persistent"
- Condition: "diarrhea"
- Qualifier: "significant"
- Condition: "weight loss"
- Condition: "disabling weakness"
- Temporal: "within 30 days of screening"